Clinical trial exclusion criterion:
Allergies to propofol

Entity relations:
- AND("Allergies", "propofol")